Clinical trial exclusion criterion:
Known pregnancy or breast-feeding.

Annotated entities:
- Condition: "pregnancy"
- Condition: "breast-feeding"